Clinical trial inclusion criterion:
American Society of Anesthesiology Physical Class 1-3.

Annotated entities:
- Measurement: "American Society of Anesthesiology Physical Class"
- Value: "1-3"